Clinical trial inclusion criterion:
2. Pancreas cancer, either s/p resection and adjuvant chemotherapy or locally advanced pancreas cancer s/p chemotherapy and radiation. Initial chemotherapy or radiation therapy may have been stopped between 2 weeks and 2 months prior to study start, and patients must have recovered from prior treatment related toxicity to grade 1 or less.

Entity relations:
- Has_qualifier("pancreas cancer", "locally advanced")
- Has_index("between 2 weeks and 2 months prior to study start", "study start")
- Has_temporal("treatment", "prior")
- Has_context("chemotherapy", "may have been stopped")
- Has_temporal("chemotherapy", "between 2 weeks and 2 months prior to study start")
- OR("s/p resection", "pancreas cancer")
- OR("chemotherapy", "radiation therapy")
- OR("resection", "pancreas cancer")
- OR("s/p adjuvant chemotherapy", "pancreas cancer")
- OR("adjuvant chemotherapy", "pancreas cancer")